Regular smoking and other regular nicotine use.

The above is a clinical trial exclusion criterion. Annotated with entity spans:
[Multiplier: Regular] [Observation: smoking] and other [Multiplier: regular] [Drug: nicotine] use.